Clinical trial exclusion criteria:
Current inpatient hospitalization or active suicidal ideation requiring referral for inpatient hospitalization for safety.
History of psychotic disorder or manic episode diagnosed by MINI-KID
History of substance dependence diagnosis by MINI-KID (excluding tobacco) or positive urine toxicology.
Pregnancy (urine pregnancy tests on the day of scans for menstruating girls).
Inability to provide written informed consent according to the Yale Human Investigation Committee (HIC) guidelines in English.

Annotated entities:
- Temporal: "Current"
- Visit: "inpatient"
- Temporal: "active"
- Condition: "suicidal ideation"
- Procedure: "referral"
- Visit: "inpatient hospitalization"
- Procedure: "hospitalization"
- Mood: "requiring"
- Temporal: "History"
- Condition: "psychotic disorder"
- Condition: "manic episode"
- Procedure: "MINI-KID"
- Temporal: "History"
- Condition: "substance dependence"
- Procedure: "MINI-KID"
- Drug: "tobacco"
- Negation: "excluding"
- Value: "positive"
- Measurement: "urine toxicology"
- Condition: "Pregnancy"
- Procedure: "urine pregnancy tests"
- Temporal: "on the day of scans"
- Person: "menstruating girls"
- Negation: "Inability to provide"
- Observation: "written informed consent"
- Qualifier: "Yale Human Investigation Committee (HIC) guidelines"
- Qualifier: "in English"